HPN < 12 months

The above is a clinical trial exclusion criterion. Annotated with entity spans:
[Measurement: HPN] [Value: < 12 months]